Which characteristics are used in the SLEDAI index for SLE patients?

Twenty-four variables were identified as important factors in a disease activity index. This generated a "weighted" index of 9 organ systems for disease activity in SLE, the SLEDAI 8 for central nervous system and vascular, 4 for renal and musculoskeletal, 2 for serosal, dermal, immunologic, and 1 for constitutional and hematologic.